關於第一型雙極性疾患（bipolar I disorder）的敘述，下列何者錯誤？
A. 多數個案第一次發作為憂鬱症，而非躁症
B. 只有極少數躁症個案，會有幻覺或妄想產生
C. 主要的治療藥物為情緒穩定劑
D. 男性的個案常合併物質濫用

正確答案：B. 只有極少數躁症個案，會有幻覺或妄想產生